朱女士60歲，食慾不振有1個月之久，曾到腸胃科求治，因超音波檢查發現大量腹水，血中CA-125 高達 U/mL，於是轉至婦科。陰道超音波檢查發現除腹水外，子宮及卵巢屬正常範圍，經一系列檢查，初步診斷為腹膜癌（peritoneal serous papillary carcinoma）。下列敘述何者錯誤？
A. 此疾病有Wolffian carcinoma的特徵
B. 此疾病之組織及免疫化學染色和卵巢癌很類似
C. 此疾病之卵巢應無侵犯，或僅侵犯卵巢上皮而未達基質，或侵犯卵巢皮層基質而腫瘤小於5×5 mm
D. 卵巢以外的病灶必須大於任何一邊卵巢的表面病灶，並且在上腹部特別是大網膜有廣泛病灶

正確答案：A. 此疾病有Wolffian carcinoma的特徵